measurable lesion by CT or other techniques according to RECIST

The above is a clinical trial inclusion criterion. Annotated with entity spans:
[Condition: measurable lesion] by [Procedure: CT] or other techniques according to RECIST